Clinical trial exclusion criterion:
Mental illness, mental retardation, or inability to participate in informed consent due to mental status

Annotated entities:
- Condition: "Mental illness"
- Condition: "mental retardation"
- Condition: "inability to participate in informed consent"
- Condition: "mental status"